Clinical trial inclusion criterion:
Blunt or penetrating trauma

Entity relations:
- OR("Blunt trauma", "penetrating trauma")